Clinical trial exclusion criterion:
History or known presence of central nervous system metastases.

Annotated entities:
- Condition: "central nervous system metastases"